Subjects who have previously undergone LASIK surgery

The above is a clinical trial inclusion criterion. Annotated with entity spans:
Subjects who have [Temporal: previously] undergone [Procedure: LASIK surgery]